Non-English speaking patient or parent/guardian for pediatric patients

The above is a clinical trial exclusion criterion. Annotated with entity spans:
[Non-query-able: Non-English speaking patient or parent/guardian for pediatric patients]